Sobre el crecimiento y desarrollo de un niño sano en el primer año de vida, ¿cuál de las siguientes afirmaciones NO es cierta?
1. Entre los 3 y 4 meses de edad, la velocidad de ganancia ponderal aumenta hasta alrededor de 40 g al día.
2. A los 4 meses se duplica el peso al nacer.
3. El peso de un recién nacido puede disminuir un 10% del peso al nacer durante la primera semana.
4. La percepción de permanencia de un objeto es un hito del desarrollo fundamental, que ocurre hacia los 9 meses de edad.
5. Al año de vida, es capaz de caminar de la mano, usa la pinza índice-pulgar para coger un objeto sin ayuda y entregarlo a otra persona bajo petición o gesto y emplea unas pocas palabras además de “papá” y “mamá”.

Respuesta correcta: 1. Entre los 3 y 4 meses de edad, la velocidad de ganancia ponderal aumenta hasta alrededor de 40 g al día.